No history of PPD allergic contact dermatitis, with a negative PPD patch test.

The above is a clinical trial inclusion criterion. Annotated with entity spans:
[Negation: No] history of [Drug: PPD] [Condition: allergic contact dermatitis], with a [Value: negative] [Measurement: PPD patch test].